No serious neurological abnormalities due to LAL

The above is a clinical trial exclusion criterion. Annotated with entity spans:
[Negation: No] [Qualifier: serious] [Condition: neurological abnormalities] [Mood: due to] [Condition: LAL]